What is the role of Gata3 in Th2 cells?

RHS6 coordinately regulates the Th2 cytokine genes by recruiting GATA3, SATB1, and IRF4. RHS6 recruited transcription factors GATA3, SATB1, and IRF4, which play important roles in expression of all three Th2 cytokine genes  IL-4-mediated STAT6 activation induces high levels of transcription of GATA3, a master regulator of Th2 cell differentiation, and enforced expression of GATA3 induces Th2 cytokine expression.